Clinical trial exclusion criterion:
Chronic nasal congestion

Entity relations:
- Has_temporal("nasal congestion", "Chronic")